下列何者為移植肺發生慢性排斥之最主要的病理變化？
A. 發炎細胞浸潤
B. 瀰漫性肺泡傷害
C. 阻塞性支氣管炎
D. 巨細胞病毒感染

正確答案：C. 阻塞性支氣管炎